Clinical trial exclusion criterion:
Subject has a history of active malignancy: A patient with a history of any invasive malignancy (except non-melanoma skin cancer), unless he/she has been treated with curative intent and there have been no signs or symptoms of the malignancy for at least two (2) years.

Entity relations:
- Has_qualifier("malignancy", "invasive")
- Has_temporal("signs or symptoms of the malignancy", "for at least two (2) years")
- Has_negation("signs or symptoms of the malignancy", "no")
- Has_negation("non-melanoma skin cancer", "except")
- AND("malignancy", "non-melanoma skin cancer")
- Has_temporal("active malignancy", "history")
- Subsumes("active malignancy", "treated with curative intent")
- OR("malignancy", "treated with curative intent")